Pervasive developmental disorder (PDD)

The above is a clinical trial exclusion criterion. Annotated with entity spans:
[Condition: Pervasive developmental disorder] ([Condition: PDD])